Clinical trial exclusion criterion:
having internal and surgical disease(after having variety of physical examination such as electrocardiogram/hepatic and renal function/blood routine and urine routine)

Annotated entities:
- Condition: "surgical disease"
- Procedure: "surgical"
- Condition: "internal disease"
- Procedure: "physical examination"
- Procedure: "electrocardiogram"
- Procedure: "hepatic function"
- Procedure: "renal function"
- Procedure: "blood routine"
- Procedure: "urine routine"
- Temporal: "after having variety of physical examination such as electrocardiogram/hepatic and renal function/blood routine and urine routine"
- Reference_point: "having variety of physical examination such as electrocardiogram/hepatic and renal function/blood routine and urine routine"